依據DSM-IV-TR的診斷標準，下列關於躁症發作（manic episode）以及輕躁症發作 （hypomanic episode）的敘述，何者正確？
A. 擔心手掌不乾淨而反覆洗手是輕躁症發作的診斷標準之一
B. 只有輕躁症發作才會有自信心膨脹（inflated self-esteem）
C. 躁症發作的嚴重程度達住院標準，時間再短也可當作一次躁症發作（manic episode）
D. 躁症與輕躁症發作的診斷標準均須有病人職業或社交等功能的顯	缺損

正確答案：C. 躁症發作的嚴重程度達住院標準，時間再短也可當作一次躁症發作（manic episode）